Clinical trial exclusion criterion:
Patients receiving benzodiazepines and narcotics.

Annotated entities:
- Drug: "benzodiazepines"
- Drug: "narcotics"